Known or suspected hepatic, symptomatic biliary disease (this includes moderate to severe chronic hepatic impairment)

The above is a clinical trial exclusion criterion. Annotated with entity spans:
Known or suspected [Condition: hepatic], symptomatic [Condition: biliary disease] (this includes [Qualifier: moderate] to [Qualifier: severe] [Condition: chronic hepatic impairment])